Existence of any surgical, medical or mental conditions, other than the current transplantation, which, in the opinion of the investigator, might interfere with the objectives of the study.

The above is a clinical trial exclusion criterion. Annotated with entity spans:
Existence of any [Condition: surgical], [Condition: medical] or [Condition: mental conditions], [Negation: other than] the [Temporal: current] [Procedure: transplantation], which, in the opinion of the investigator, [Qualifier: might interfere with the objectives of the study].